Clinical trial exclusion criteria:
Subjects not able to give informed consent
Left Bundle Branch Block
Thrombolytic therapy within 24 hours before randomization
Oral anticoagulation with International Normalized Ratio (INR) > 2
Known platelets < 100.000/µl or known hemorrhagic diathesis
Stroke or Transient Ischemic Attack (TIA) within the past 6 months or any permanent residual neurological defect
Evidence of an active gastrointestinal or urogenital bleeding
Major surgery within 6 weeks
History of allergic reaction to abciximab or eptifibatide or any component used in the study (including contrast media)
Known severe renal (creatinine clearance <30ml/min) or hepatic insufficiency as well as Alanine transaminase (ALT)/aspartate transaminase (AST) elevations = 3xUpper limit normal (ULN); isolated AST-elevation is not considered an exclusion criteria from study participation
Severe concomitant disease with life expectation < 1 year
Subject has participated in any study using an investigational drug or device within 30 days or within 5 half-lives of the investigational drug (whichever is longer) of entry into this study.
Subjects who will be inaccessible due to geographic or social factors during treatment or follow-up
In France, a subject is neither affiliated with nor a beneficiary of a social security category.

Annotated entities:
- Negation: "not"
- Informed_consent: "give informed consent"
- Mood: "able to"
- Condition: "Left Bundle Branch Block"
- Procedure: "Thrombolytic therapy"
- Temporal: "within 24 hours before randomization"
- Reference_point: "randomization"
- Procedure: "Oral anticoagulation"
- Measurement: "International Normalized Ratio (INR)"
- Value: "> 2"
- Measurement: "platelets"
- Value: "< 100.000/µl"
- Condition: "hemorrhagic diathesis"
- Condition: "Transient Ischemic Attack (TIA)"
- Condition: "Stroke"
- Temporal: "within the past 6 months"
- Condition: "residual neurological defect"
- Condition: "gastrointestinal bleeding"
- Condition: "urogenital bleeding"
- Temporal: "active"
- Temporal: "within 6 weeks"
- Procedure: "Major surgery"
- Condition: "allergic reaction"
- Temporal: "History"
- Drug: "abciximab"
- Drug: "eptifibatide"
- Drug: "component used in the study"
- Drug: "contrast media"
- Measurement: "creatinine clearance"
- Value: "<30ml/min"
- Condition: "hepatic insufficiency"
- Measurement: "Alanine transaminase (ALT)"
- Measurement: "aspartate transaminase (AST)"
- Value: "elevations"
- Value: "3xUpper limit normal (ULN)"
- Condition: "renal insufficiency"
- Qualifier: "severe"
- Condition: "Severe disease"
- Measurement: "life expectation"
- Value: "< 1 year"
- Temporal: "concomitant"
- Observation: "participated in any study"
- Drug: "investigational drug"
- Device: "device"
- Temporal: "of the investigational drug within 30 days"
- Temporal: "within 5 half-lives of the investigational drug"
- Reference_point: "of the investigational drug"
- Observation: "inaccessible"
- Temporal: "during treatment or follow-up"
- Reference_point: "treatment"
- Reference_point: "follow-up"
- Non-representable: "In France, a subject is neither affiliated with nor a beneficiary of a social security category."